Patients undergoing percutaneous coronary intervention and need to take dual antiplatelet therapy continuously at least 12weeks

The above is a clinical trial inclusion criterion. Annotated with entity spans:
Patients undergoing [Procedure: percutaneous coronary intervention] and need to take [Procedure: dual antiplatelet therapy] [Qualifier: continuously] [Temporal: at least 12weeks]